Describe ANTISOMA

The ANTISOMA method is a computerized pipeline for the reduction of the aggregation tendency of monoclonal antibodies (mAbs) based on an automated amino acid substitution approach. The method is available online at http://bioinformatics.biol.uoa.gr/antisoma.